下列那一種細胞是由中胚層衍生而來？
A. 原始生殖細胞（primordial germ cell）
B. 血島細胞（blood island）
C. 氣管之內襯上皮細胞
D. 神經嵴細胞（neural crest cell）

正確答案：B. 血島細胞（blood island）